Clinical trial inclusion criterion:
Patients on chronic statin treatment (>30 days) scheduled for isolated CABG, including on- or off-pump or repeat (redo's) revascularisation procedures

Entity relations:
- AND("treatment", "statin")
- Has_multiplier("treatment", "chronic")
- Has_value("treatment", ">30 days")
- Has_qualifier("CABG", "isolated")
- Has_mood("CABG", "scheduled")
- Subsumes("on- or off-pump or repeat", "redo's")
- Has_qualifier("revascularisation procedures", "on- or off-pump or repeat")
- Subsumes("CABG", "revascularisation procedures")